Clinical trial exclusion criterion:
Sleep apnea or morbid obesity with possible sleep apnea

Annotated entities:
- Condition: "Sleep apnea"
- Condition: "morbid obesity"
- Mood: "possible"
- Condition: "sleep apnea"